骨骼肌收縮過程中，Myosin head 藉由下列何種作用轉化為高能狀態（High-energy state）？
A. ATP 水解
B. 與 Actin 結合
C. 與 Titin 結合
D. the condensation of ATP

正確答案：A. ATP 水解